下列何者不是由頸襻（ansa cervicalis）上、下根（superior and inferior roots）的分支支配？
A. 胸骨舌骨肌（sternohyoid muscle）
B. 肩胛舌骨肌（omohyoid muscle）
C. 胸骨甲狀肌（sternothyroid muscle）
D. 甲狀舌骨肌（thyrohyoid muscle）

正確答案：D. 甲狀舌骨肌（thyrohyoid muscle）